Minimal use of nasal decolonization* *Minimal use defined as <15% of residents receiving at least one chlorhexidine bath or nasal decolonization treatment during their nursing home stay.

The above is a clinical trial inclusion criterion. Annotated with entity spans:
[Multiplier: Minimal use] of [Procedure: nasal decolonization]* *[Multiplier: Minimal use] defined as [Value: <15%] of [Measurement: residents receiving at least one chlorhexidine bath] or [Procedure: nasal decolonization treatment] [Temporal: during their nursing home stay].